Clinical trial exclusion criterion:
Known proved BKV nephropathy

Entity relations:
- Has_qualifier("BKV nephropathy", "proved")